age less than 18 years old

The above is a clinical trial exclusion criterion. Annotated with entity spans:
[Person: age] [Value: less than 18 years old]